下列那一類藥物最適合用於治療患有 Zollinger-Ellison syndrome 的病人？
A. antacids
B. H2 antagonists
C. proton pump inhibitors
D. anticholinergic agents

正確答案：C. proton pump inhibitors